Likely suffer moderate-to-severe OSA based on history and physical or have an established diagnosis of OSA (20=AHI=65) based on a prior in-lab Polysomnography

The above is a clinical trial inclusion criterion. Annotated with entity spans:
Likely suffer [Qualifier: moderate]-to-[Qualifier: severe] [Condition: OSA] based on history and physical or have an established diagnosis of [Condition: OSA] ([Value: 20]=[Measurement: AHI]=65) based on a prior in-lab Polysomnography